Clinical trial exclusion criterion:
Family or personal history of medullary thyroid carcinoma

Entity relations:
- Has_context("medullary thyroid carcinoma", "Family")
- OR("Family", "personal history")